2. The subject has pre-existing sustained supine hypertension greater than 180mmHg systolic and 110mmHg diastolic BP or had these measurements at the Screening Visit. Sustained is defined as persistently greater at 2 separate measurements at least 5 minutes apart with the subject supine and at rest for the 5 minutes.

The above is a clinical trial exclusion criterion. Annotated with entity spans:
2. The subject has [Temporal: pre-existing] [Temporal: sustained] [Condition: supine hypertension] [Value: greater than 180mmHg systolic] and [Value: 110mmHg diastolic] [Measurement: BP] or had these measurements [Temporal: at the Screening Visit]. Sustained is defined as [Temporal: persistently] [Value: greater] at [Multiplier: 2 separate] [Measurement: measurements] at least 5 minutes apart with the subject supine and at rest for the 5 minutes.